Clinical trial exclusion criteria:
Inmate of a correctional facility (i.e. prisoners).
Pregnancy
Documented or suspected family or personal history of malignant hyperthermia.
Patient unable to receive either propofol or isoflurane due to allergy or other specific contraindication.

Annotated entities:
- Person: "Inmate of a correctional facility"
- Person: "prisoners"
- Condition: "Pregnancy"
- Condition: "malignant hyperthermia"
- Temporal: "history family"
- Temporal: "personal history"
- Drug: "propofol"
- Drug: "isoflurane"
- Condition: "allergy"
- Condition: "unable to receive"